3 歲小女生，因為陰道出血來門診求診，骨盆腔檢查發現在陰道口有一葡萄樣的突出物，其顯微鏡下有成堆的細胞排列成 cambium layer 特徵，則最可能的診斷為：
A. 尿道脫垂（urethral prolapse）
B. 尖圭濕疣（condyloma acuminatum）
C. 胚胎性橫紋肌肉瘤（embryonal rhabdomyosarcoma）
D. 陰道息肉（vaginal polyps）

正確答案：C. 胚胎性橫紋肌肉瘤（embryonal rhabdomyosarcoma）